With Child score B or C

The above is a clinical trial inclusion criterion. Annotated with entity spans:
With [Measurement: Child score] [Value: B] or [Value: C]